Clinical trial exclusion criterion:
Current pregnancy as assessed by preoperative urine HCG test

Entity relations:
- Has_value("urine HCG test", "pregnancy")